El cloruro presente en una disolución se puede determinar volumétricamente, mediante el método de Mohr, utilizando Ag (I) como reactivo. ¿Qué indicador se utiliza en esta valoración?:
1. K2Cr2O7.
2. Fe2(SO4)3.
3. K2CrO4.
4. KSCN.
5. FeSO4.

Respuesta correcta: 3. K2CrO4.